一位 80 歲老先生因為記憶力逐漸減退已有 2 年，由家人陪伴初次來看門診，你的第一個步驟是先作：
A. 詳細詢問其病史及作理學及神經學檢查
B. 腦部電腦斷層
C. 腦波
D. 腦部磁振造影

正確答案：A. 詳細詢問其病史及作理學及神經學檢查